下列何種血液性疾病，在典型的案例中脾臟常會出現骨髓外造血及腫大？
A. 鐮刀型紅血球病（sickle-cell disease）
B. 缺鐵性貧血（iron deficiency anemia）
C. 原發性骨髓纖維化（primary myelofibrosis）
D. 免疫性血小板缺乏紫斑症（immune thrombocytopenic purpura）

正確答案：C. 原發性骨髓纖維化（primary myelofibrosis）